Clinical trial exclusion criterion:
Parkinson's disease already treated with APOMORPHINE pump or justifying the use of the pump continuously day and night

Entity relations:
- AND("Parkinson's disease", "APOMORPHINE")